Maintenance or prophylactic therapy for stable medical conditions.

The above is a clinical trial exclusion criterion. Annotated with entity spans:
[Non-query-able: Maintenance or prophylactic therapy for stable medical conditions].